Clinical trial exclusion criterion:
Patients with placenta pathology such as praevia, acreta, pre-eclampsia

Entity relations:
- Subsumes("placenta pathology", "praevia")
- OR("praevia", "pre-eclampsia", "acreta")